Clinical trial inclusion criterion:
2. Off antiretroviral therapy (ART) for > 6 weeks before the study and no plans to begin treatment for the study duration. (The decision of whether or not a subject takes antiretroviral therapy will be made by the subject in consultation with his/her primary care provider prior to screening for this study.)

Annotated entities:
- Procedure: "antiretroviral therapy (ART)"
- Condition: "Off antiretroviral therapy (ART)"
- Temporal: "> 6 weeks before the study"
- Reference_point: "the study"
- Mood: "plans to begin"
- Procedure: "treatment"
- Temporal: "for the study duration"
- Reference_point: "study"
- Negation: "no"
- Context_Error: "treatment"